Clinical trial exclusion criterion:
Concomitant administration of any other experimental drug under investigation, or concomitant chemotherapy, hormonal therapy, or immunotherapy

Entity relations:
- Has_temporal("experimental drug", "Concomitant")
- Has_temporal("chemotherapy", "concomitant")
- OR("chemotherapy", "hormonal therapy", "immunotherapy")
- OR("experimental drug", "chemotherapy")